Metabolic disease contraindicating use of the ketogenic diet e.g. pyruvate carboxylase deficiency, MCAD from previous medical investigation and screening at baseline.

The above is a clinical trial exclusion criterion. Annotated with entity spans:
[Condition: Metabolic disease] [Condition: contraindicating] use of the [Procedure: ketogenic diet] e.g. [Condition: pyruvate carboxylase deficiency,] [Condition: MCAD] from previous medical investigation and screening at baseline.